Clinically significant bleeding within the last 30 days.

The above is a clinical trial exclusion criterion. Annotated with entity spans:
[Qualifier: Clinically significant] [Condition: bleeding] [Temporal: within the last 30 days].